8. Reached an average daily pain rating during the baseline week of pain ratings greater than 4 on the 0-to-10 numerical pain rating scale (Question 5 of the BPI)

The above is a clinical trial inclusion criterion. Annotated with entity spans:
8. Reached an [Qualifier: average] [Measurement: daily pain rating] [Temporal: during the baseline week] of pain ratings [Value: greater than 4] on the [Procedure: 0-to-10 numerical pain rating scale] (Question 5 of the BPI)